creatinine clearance less than 30 ml/min

The above is a clinical trial exclusion criterion. Annotated with entity spans:
[Measurement: creatinine clearance] [Value: less than 30 ml/min]